Clinical trial inclusion criterion:
1. Subject has a history of GTC seizures, either primary GTC or partial onset seizures with secondary generalization.

Entity relations:
- AND("partial onset seizures", "secondary generalization")
- Subsumes("GTC seizures", "primary GTC")
- Has_temporal("GTC seizures", "history")
- OR("primary GTC", "partial onset seizures")